4. Have pulmonary edema, ascites or pitting edema on clinical examination.

The above is a clinical trial exclusion criterion. Annotated with entity spans:
4. Have [Condition: pulmonary edema], [Condition: ascites] or [Condition: pitting edema] on clinical examination.